Clinical trial exclusion criterion:
History of transjugular, intrahepatic, portosystemic shunt (TIPS) or vascular decompression surgery

Annotated entities:
- Procedure: "transjugular, intrahepatic, portosystemic shunt (TIPS)"
- Procedure: "vascular decompression surgery"
- Temporal: "History"